Where is the protein Bouncer located?

Bouncer is membrane bound.